下列何者不是惡性乳房腫瘤在乳房超音波（ultrasound or sonography）的特徵？
A. hypo-echoic
B. taller than wide shape
C. tumor size larger than 3 cm
D. posterior wall attenuation

正確答案：C. tumor size larger than 3 cm